Clinical trial exclusion criterion:
Has had a chest x-ray within 2 months prior to Screening that shows an abnormality suggestive of a current active infection or malignancy

Annotated entities:
- Procedure: "chest x-ray"
- Temporal: "within 2 months prior to Screening"
- Condition: "abnormality"
- Mood: "suggestive"
- Temporal: "current"
- Qualifier: "active"
- Condition: "infection"
- Condition: "malignancy"
- Reference_point: "Screening"